Clinical trial inclusion criterion:
Patient informed and consent signature obtained

Annotated entities:
- Post-eligibility: "Patient informed and consent signature obtained"